下列那一種健康服務的財源，引發所得或財富的重分配效果最強？
A. 政府一般稅收
B. 強制性社會保險
C. 私人健康保險
D. 自費醫療服務

正確答案：A. 政府一般稅收